Clinical trial inclusion criterion:
ASA I, II, III.

Annotated entities:
- Measurement: "ASA"
- Value: "I, II, III"